Clinical trial exclusion criterion:
The patient has a history of aspirin allergy

Annotated entities:
- Drug: "aspirin"
- Condition: "allergy"
- Temporal: "history of"